Clinical trial inclusion criterion:
Children aged 0-59 months living with families registered in the rural Bandim Health Project Health and Demographic Surveillance Site are included, provided a parent/guardian consent.

Annotated entities:
- Person: "Children"
- Person: "aged"
- Value: "0-59 months"
- Observation: "living with families registered in the rural Bandim Health Project Health"
- Visit: "Person Surveillance Site"